La ranolazina está relacionada estructural y farmacológicamente con:
1. Cetirizina.
2. Racecadotrilo.
3. Ranitidina.
4. Trimetazidina.

Respuesta correcta: 4. Trimetazidina.